有關膽囊切除術建議使用開腹手術而非內視鏡切除術之敘述，下列何者錯誤？
A. 嚴重之心臟衰竭病患
B. 懷疑或已知有膽囊的惡性疾病
C. 懷孕 7 到 9 個月的孕婦
D. 膽結石堵塞造成膽囊腫脹

正確答案：D. 膽結石堵塞造成膽囊腫脹